Clinical trial exclusion criterion:
Patients with a baseline (pre-operative) opioid use greater than 30 mg of morphine equivalents/day.

Annotated entities:
- Drug: "opioid"
- Qualifier: "baseline"
- Qualifier: "pre-operative"
- Multiplier: "greater than 30 mg of morphine equivalents/day"